type 1 diabetes,specific types of diabetes,gestational diabetes or pregestational diabetes;

The above is a clinical trial exclusion criterion. Annotated with entity spans:
[Condition: type 1 diabetes],[Qualifier: specific types] of [Condition: diabetes],[Condition: gestational diabetes] or [Condition: pregestational diabetes];